Which gene is associated with the Mitchell-Riley syndrome?

Mutations in the gene coding for the transcription factor RFX6 (regulatory factor X,6) have been described as the cause of the Mitchell-Riley syndrome.